有關陰莖病變的敘述，下列何者正確？
A. Peyronie's disease 好發於年輕男性，在陰莖背側常摸到硬塊，勃起時會疼痛，嚴重時引起陰莖彎曲
B. 陰莖折斷（penile fracture）常見於機車車禍
C. 白血病引起的陰莖持續性勃起（priapism），不須處理會自然消退
D. 陰莖潰瘍（ulcer）長期以適當藥物治療仍未癒合，應考慮切片檢查

正確答案：D. 陰莖潰瘍（ulcer）長期以適當藥物治療仍未癒合，應考慮切片檢查